Clinical trial exclusion criterion:
habitual opioid consumption;

Annotated entities:
- Observation: "opioid consumption"
- Qualifier: "habitual"